Clinical trial exclusion criterion:
History of or presence of any clinically significant disease or disorder including a recent (< 3 months) cardiovascular event which, in the opinion of the Investigator, may either put the patient at risk because of participation in the study or influence the results or the patient's ability to participate in the study.

Annotated entities:
- Qualifier: "clinically significant"
- Condition: "disease"
- Condition: "disorder"
- Temporal: "recent"
- Temporal: "< 3 months"
- Condition: "cardiovascular event"
- Post-eligibility: "History of or presence of any clinically significant disease or disorder including a recent (< 3 months) cardiovascular event which, in the opinion of the Investigator, may either put the patient at risk because of participation in the study or influence the results or the patient's ability to participate in the study"